關於嬰兒玫瑰疹（roseola）的敘述，下列何者錯誤？
A. 可由人類疱疹第六型病毒（human herpesvirus 6）感染所造成
B. 被感染的成人有可能產生單核球增多症（mononucleosis）
C. 被感染的幼兒通常不會發燒
D. 病人體內的病毒會在Ｔ細胞內造成潛伏性感染（latent infection）

正確答案：C. 被感染的幼兒通常不會發燒